Clinical trial inclusion criterion:
5. ECOG performance status of 0 or 1.

Entity relations:
- Has_value("ECOG performance status", "0 or 1")